梅毒病變中，最顯	且多量的浸潤細胞是：
A. 漿細胞
B. 淋巴球
C. 巨噬細胞
D. 嗜伊紅性白血球

正確答案：A. 漿細胞